Clinical trial exclusion criterion:
beta blocker

Annotated entities:
- Drug: "beta blocker"